第三、四腦室旁及乳頭體（mamillary body）點狀出血並出現神經學症狀，係因下列何者所造成？
A. thiamine 缺乏
B. riboflavin 缺乏
C. 銅過量
D. 鐵過量

正確答案：A. thiamine 缺乏